與睪丸的 Seminoma 有相同組織病理形態的卵巢腫瘤稱為：
A. Sertoli-Leydig cell tumor
B. Brenner tumor
C. Yolk sac tumor
D. Dysgerminoma

正確答案：D. Dysgerminoma